Por lo que respecta a las funciones adaptativas de las emociones, indique qué emoción de las siguientes “despierta simpatía y atención” para el sistema interpersonal:
1. Tristeza.
2. Alegría.
3. Culpabilidad.
4. Miedo.
5. Desdén.

Respuesta correcta: 1. Tristeza.